聲波震動在人類耳部的傳導順序，下列何者正確？①tympanic membrane ②middle-ear bones ③round window membrane ④basilar membrane ⑤oval window membrane
A. ①②③④⑤
B. ②①④③⑤
C. ①②③⑤④
D. ①②⑤④③

正確答案：D. ①②⑤④③